Clinical trial exclusion criterion:
Exclusion Criteria patients: Substance abuse on a daily basis during the last 3 month or patients fulfilling the criteria of ongoing substance abuse due to ICD-10/DSM-IV/V, Treatment with antidepressant during the last 30 days, Head injury with more than 5 minutes of unconsciousness, Patients involuntarily admitted or treated, Components of metal implanted by operation, Pacemaker, Pregnancy, Severe physical illness

Entity relations:
- Has_multiplier("Substance abuse", "daily basis")
- Has_multiplier("Substance abuse", "during the last 3 month")
- Has_temporal("substance abuse", "ongoing")
- Has_qualifier("substance abuse", "ICD-10/DSM-IV/V")
- Has_temporal("antidepressant", "during the last 30 days")
- Has_multiplier("unconsciousness", "more than 5 minutes")
- AND("Head injury", "unconsciousness")
- AND("patients", "Substance abuse")
- OR("Substance abuse", "Severe physical illness", "Pacemaker", "Components of metal", "involuntarily admitted", "involuntarily treated", "Head injury", "antidepressant", "substance abuse", "Pregnancy")